一位 52 歲女性，BUN 60 mg/dL，creatinine 1.8 mg/dL，看起來皮膚乾燥，兩腳無水腫，病人有口乾現象，則應懷疑那一種狀況？
A. 腎前性氮血症（Pre-renal azotemia）
B. 腎後性氮血症（Post-renal azotemia）
C. 腎性氮血症（Renal azotemia）
D. 無法判斷

正確答案：A. 腎前性氮血症（Pre-renal azotemia）